A un paciente de Bolivia diagnosticado de enfermedad de Chagas se le realiza un hemograma que muestra 1.100 eosinófilos/µL (12% de los leucocitos). ¿Cuál de los siguientes diagnósticos es el MENOS probable?
1. Infestación por Schistosoma haematobium.
2. Infestación por Ancylostoma duodenalis.
3. Infestación por Strongyloides stercoralis.
4. Infestación por Ascaris lumbricoides.
5. Infestación por Necator americanus.

Respuesta correcta: 1. Infestación por Schistosoma haematobium.